En una valoración se emplea el indicador redox In (ox) + ne-  In (red), cuyo potencial normal es E0. El cambio de color se producirá:
1. Al potencial del punto de equivalencia.
2. Al valor de E0.
3. En el intervalo E0  0.059 / n.
4. En el intervalo E0 (ox) – E0 (red) si se valora con un reductor.
5. Al potencial de 0.059 / n.

Respuesta correcta: 3. En el intervalo E0  0.059 / n.